Clinical trial exclusion criterion:
Patients with known or suspected hypersensitivity to the used medication were also excluded from the study.

Entity relations:
- Has_mood("hypersensitivity", "known")
- AND("hypersensitivity", "used medication")
- OR("known", "suspected")